Clinical trial inclusion criterion:
Probable or definite diagnosis of autoimmune hepatitis according to the International Autoimmune Hepatitis Study Group criteria

Annotated entities:
- Condition: "autoimmune hepatitis"
- Measurement: "International Autoimmune Hepatitis Study Group criteria"